Clinical trial exclusion criterion:
Premorbid, ongoing major depression or psychosis, altered cognitive status

Entity relations:
- Has_temporal("major depression", "ongoing")
- Has_qualifier("major depression", "Premorbid")
- OR("major depression", "psychosis")
- OR("major depression", "altered cognitive status")